Clinical trial inclusion criterion:
gastric malignancy, including adenocarcinoma and lymphoma,

Annotated entities:
- Condition: "gastric malignancy"
- Condition: "adenocarcinoma"
- Condition: "lymphoma"